Clinical trial inclusion criterion:
Minimum 1 cm,

Annotated entities:
- Non-representable: "Minimum 1 cm,"